Tubal ligation and infertility surgery

The above is a clinical trial exclusion criterion. Annotated with entity spans:
[Procedure: Tubal ligation] and [Procedure: infertility surgery]